Clinical trial exclusion criterion:
any medical condition that would contraindicate use of stimulant medication

Annotated entities:
- Condition: "medical condition"
- Condition: "contraindicate"
- Drug: "stimulant medication"